下列關於橫膈的敘述，何者正確？
A. 是最主要的呼氣肌
B. 胸主動脈及腹主動脈各有直接的動脈分枝供應橫膈
C. 膈神經源自頸神經 C2、C3 及 C4
D. 膈神經為橫膈之唯一的感覺與運動神經

正確答案：B. 胸主動脈及腹主動脈各有直接的動脈分枝供應橫膈